下列那種淋巴瘤不屬於高惡性度？
A. 淋巴母細胞淋巴瘤（lymphoblastic lymphoma）
B. Burkitt 氏淋巴瘤
C. 成人 T 細胞淋巴瘤（adult T-cell lymphoma）
D. 濾泡型淋巴瘤（follicular lymphoma）

正確答案：D. 濾泡型淋巴瘤（follicular lymphoma）